Hombre de 43 años fumador de 20 cigarrillos al día, que acude a su consulta llevado por un familiar, debido a que lleva 10 días durmiendo poco, menos de 3 horas al día sin referir cansancio por ello. Añade que ha empezado a gastar grandes cantidades de dinero, comprometiendo las finanzas familiares. Se encuentra verborreico, con aceleración del pensamiento y con apariencia megalomaníaca. Como antecedentes personales no hay enfermedades de interés salvo un episodio depresivo hace 5 años. No cree que le pase nada, pero ha aceptado acudir a la consulta con la intención de buscar ayuda para dejar de fumar. No hay consumo de otros tóxicos y la analítica y exploración neurológica no aportan datos anormales. En este paciente teniendo en cuenta su diagnóstico más probable, qué tratamiento sería el MENOS indicado:
1. Bupropion.
2. Ácido valproico.
3. Carbonato de litio.
4. Risperidona.
5. Olanzapina.

Respuesta correcta: 1. Bupropion.